Clinical trial exclusion criterion:
major anesthetic risk factors or history of previous problem with anesthesia

Entity relations:
- Has_qualifier("anesthetic risk factors", "major")
- Has_temporal("problem with anesthesia", "previous")
- OR("anesthetic risk factors", "problem with anesthesia")